Clinical trial inclusion criterion:
Men and women aged 18-45 years.

Annotated entities:
- Person: "Men"
- Person: "women"
- Person: "aged"
- Value: "18-45 years"